Afectan al funcionamiento normal de la DNA girasa bacteriana las:
1. Quinolonas.
2. Macrólidos.
3. Tetraciclinas.
4. Penicilinas.

Respuesta correcta: 1. Quinolonas.